ED Physicians who are routinely using U/S guided RA for hip fracture patients, or decline participation in the trial.

The above is a clinical trial exclusion criterion. Annotated with entity spans:
[Non-query-able: ED Physicians who are routinely using U/S guided RA for hip fracture patients, or decline participation in the trial.]